Clinical trial exclusion criterion:
Contraindications for medication abortion

Annotated entities:
- Condition: "Contraindications"
- Procedure: "medication abortion"